Clinical trial exclusion criterion:
Current active dental problems including infection of the teeth or jawbone (maxilla or mandibular); dental or fixture trauma, or a current or prior diagnosis of osteonecrosis of the jaw (ONJ), of exposed bone in the mouth, or of slow healing after dental procedures.

Entity relations:
- Has_temporal("dental problems", "Current")
- Subsumes("infection of the teeth", "infection of the maxilla")
- AND("current", "osteonecrosis of the jaw (ONJ)")
- Subsumes("dental problems", "infection of the teeth")
- Subsumes("dental problems", "current")
- OR("infection of the teeth", "infection of the jawbone")
- OR("infection of the maxilla", "infection of the mandibular")
- OR("infection of the teeth", "dental trauma", "fixture trauma")
- OR("current", "prior")
- OR("osteonecrosis of the jaw (ONJ)", "slow healing after dental procedures", "exposed bone in the mouth")